En las infecciones latentes del virus del herpes simple humano, las partículas víricas permanecen característicamente en:
1. Las neuronas.
2. Los linfocitos B.
3. Los linfocitos T.
4. Las células mieloides.
5. Los granulocitos.

Respuesta correcta: 1. Las neuronas.